Clinical trial exclusion criterion:
other things affecting hand function

Annotated entities:
- Condition: "other things"
- Qualifier: "affecting hand function"